Clinical trial inclusion criterion:
Eastern Cooperative Oncology Group (ECOG) performance status of 0 - 2

Entity relations:
- Subsumes("Eastern Cooperative Oncology Group performance status", "ECOG")
- Has_value("Eastern Cooperative Oncology Group performance status", "0 - 2")